Clinical trial exclusion criterion:
History of hypersensitivity to vaccines.

Annotated entities:
- Condition: "hypersensitivity to vaccines"
- Temporal: "History"